Las condiciones de reacción para transformar la nonanamida en octanamina y dióxido de carbono son:
1. H2, catalizador metálico.
2. Exceso de CH3I, K2 CO3.
3. Cl2, NaOH, H2O.
4. LiAlH4, dietil éter y luego hidrólisis.
5. CH2N2, dietil éter.

Respuesta correcta: 3. Cl2, NaOH, H2O.